一位 30 歲男性因為右膝骨折脫臼合併膕動脈（popliteal artery）斷裂，接受緊急血管吻合術以及筋膜切開術後，隔天病人發生尿量減少（oligouria），抽血檢查發現 GOT 200 mg/dL，myoglobin 5700 ug/L。請問下列那一種狀況最能解釋目前的病情？
A. 膕動脈再次阻塞（delayed popliteal artery occlusion）
B. 腔室症候群（compartment syndrome）
C. 多重器官衰竭（multiple organ failure）
D. 缺血再灌流傷害（ischemia-reperfusion injury）

正確答案：D. 缺血再灌流傷害（ischemia-reperfusion injury）